Clinical trial inclusion criterion:
18 years or older

Entity relations:
- Has_value("years", "18 or older")